Clinical trial inclusion criterion:
Patients diagnosed with acromegaly with GH-secreting pituitary adenoma on sellar MRI, meeting the biochemical criteria outlined above (refer to 1. Diagnosis of acromegaly) and with typical acromegalic features.

Annotated entities:
- Condition: "acromegaly"
- Condition: "GH-secreting pituitary adenoma"
- Procedure: "sellar MRI"
- Qualifier: "biochemical criteria outlined above"
- Condition: "acromegalic features"
- Qualifier: "typical"